Estimated life expectancy of more than 3 months

The above is a clinical trial inclusion criterion. Annotated with entity spans:
[Measurement: Estimated life expectancy] of [Value: more than 3 months]